Which genes are the main markers of primitive Endoderm (prEN) formation?

Fgf receptor/Erk signalling is known to be required for specification of the primitive endoderm. Platelet derived growth factor receptor alpha (Pdgfrα) as an early-expressed protein that is also a marker of the later primitive endoderm lineage. ES cells expressing exogenous EGAM1 preferentially differentiate into extra-embryonic primitive endoderm.  Lrp2 is a novel PrE precursor (pre-PrE) marker by using a microarray strategy that combines a transcriptome analysis of three stem cell lines and early embryos.